Clinical trial exclusion criterion:
known impaired renal function

Annotated entities:
- Condition: "impaired renal function"